Clinical trial exclusion criterion:
Clinically significant intercurrent illnesses (except for respiratory or liver disease secondary to AAT deficiency), including: cardiac, hepatic, renal, endocrine, neurological, hematological, neoplastic, immunological, skeletal or other) that in the opinion of the investigator, could interfere with the safety, compliance or other aspects of this study. Patients with well-controlled, chronic diseases could possibly be included after consultation with the treating physician and the sponsor.

Annotated entities:
- Condition: "intercurrent illnesses"
- Qualifier: "Clinically significant"
- Subjective_judgement: "Clinically significant"
- Undefined_semantics: "Clinically significant"
- Negation: "except for"
- Condition: "respiratory disease"
- Condition: "liver disease"
- Qualifier: "secondary to AAT deficiency"
- Condition: "AAT deficiency"
- Condition: "cardiac"
- Condition: "hepatic"
- Condition: "renal"
- Condition: "endocrine"
- Condition: "neurological"
- Condition: "hematological"
- Condition: "neoplastic"
- Condition: "immunological"
- Condition: "skeletal"
- Condition: "other"
- Undefined_semantics: "other"
- Subjective_judgement: "in the opinion of the investigator"
- Post-eligibility: "Clinically significant intercurrent illnesses (except for respiratory or liver disease secondary to AAT deficiency), including: cardiac, hepatic, renal, endocrine, neurological, hematological, neoplastic, immunological, skeletal or other) that in the opinion of the investigator, could interfere with the safety, compliance or other aspects of this study. Patients with well-controlled, chronic diseases could possibly be included after consultation with the treating physician and the sponsor."